下列有關能量攝取與甲狀腺的關係，何者正確？
A. 攝取過量的碳水化合物可抑制甲狀腺素（thyroxine）的分泌
B. 來自脂肪組織的瘦體素（leptin）可促進甲釋素（thyrotropin releasing hormone）的分泌
C. 瘦體素抑制甲狀腺素的分泌
D. 甲狀腺素過多會抑制瘦體素的分泌

正確答案：B. 來自脂肪組織的瘦體素（leptin）可促進甲釋素（thyrotropin releasing hormone）的分泌